Clinical trial exclusion criterion:
Abnormal renal function as evidenced by a calculated creatinine clearance < 30 ml/minute.

Entity relations:
- Has_value("renal function", "Abnormal")
- Has_value("calculated creatinine clearance", "< 30 ml/minute")
- Subsumes("Abnormal", "calculated creatinine clearance")